Clinical trial exclusion criteria:
1. Presence of other neoplasia
2. Man

Annotated entities:
- Parsing_Error: "1."
- Condition: "neoplasia"
- Qualifier: "other"
- Parsing_Error: "2."
- Person: "Man"